一位5歲兒童，發生Ventricular fibrillation，使用defibrillation時之劑量為何？
A. 起初defibrillation劑量為4J/kg
B. 再次defibrillation劑量為6J/kg
C. 再次defibrillation劑量為8J/kg
D. 第三次defibrillation劑量為4J/kg

正確答案：D. 第三次defibrillation劑量為4J/kg